¿Cuál es la geometría de los complejos mononucleares de Ni (II)?
1. La mayor parte de los complejos de      Ni (II) presentan índice de coordinación 8.
2. La mayor parte de los complejos de      Ni (II) son bipirámides trigonales.
3. La mayor parte de los complejos de      Ni (II) son tetraédricos.
4. La mayor parte de los complejos de      Ni (II) son octaédricos o planocuadrados.

Respuesta correcta: 4. La mayor parte de los complejos de      Ni (II) son octaédricos o planocuadrados.